Clinical trial inclusion criterion:
Maximal inspiratory pressure (MIP) <70% of predicted;

Entity relations:
- Has_value("Maximal inspiratory pressure (MIP)", "<70% of predicted")